Clinical trial inclusion criterion:
Stone free after definitive surgical therapy defined as fragments less than 3mm.

Entity relations:
- Has_negation("Stone", "free")
- Has_index("after definitive surgical therapy", "definitive surgical therapy")
- multi("definitive surgical therapy", "definitive surgical therapy")
- Has_temporal("Stone", "after definitive surgical therapy")
- Subsumes("Stone", "fragments less than 3mm")